Clinical trial exclusion criterion:
Post-hysterectomy.

Annotated entities:
- Procedure: "hysterectomy"
- Temporal: "Post"